Clinical trial exclusion criterion:
Central Nervous System (CNS) abnormalities (e.g., cerebral aneurysm) and/or other vascular abnormalities such as vasculitis or pre-existing stroke, motor tics or a family history or diagnosis of Tourette's syndrome, seizures (convulsions, epilepsy), or abnormal EEGs

Annotated entities:
- Condition: "Central Nervous System (CNS) abnormalities"
- Condition: "cerebral aneurysm"
- Condition: "vascular abnormalities"
- Condition: "vasculitis"
- Condition: "stroke"
- Temporal: "pre-existing"
- Condition: "motor tics"
- Observation: "family history"
- Condition: "Tourette's syndrome"
- Condition: "seizures"
- Condition: "convulsions"
- Observation: "diagnosis"
- Condition: "epilepsy"
- Qualifier: "abnormal"
- Condition: "EEGs"